Clinical trial exclusion criterion:
Patients with do-not-resuscitate (DNR) status;

Annotated entities:
- Observation: "do-not-resuscitate (DNR) status"